Se utiliza la naloxona en el tratamiento de la intoxicación con:
1. Opiáceos.
2. Benzodiacepinas.
3. Barbitúricos.
4. Antidepresivos tricíclicos.
5. Digitálicos.

Respuesta correcta: 1. Opiáceos.